Clinical trial inclusion criterion:
18 years of age or older

Annotated entities:
- Person: "age"
- Value: "18 years of or older"